三個傾聽病人的關鍵技巧分別是「主動性傾聽」、「反射性傾聽」及「同理性傾聽」，下列例子何者不屬於「同理性傾聽」？
A. 「你似乎不很舒服」
B. 「你似乎非常緊張」
C. 「那對你一定很困難」
D. 「換句話說，那聽起來，像是⋯」

正確答案：D. 「換句話說，那聽起來，像是⋯」